Clinical trial inclusion criterion:
Male or non-pregnant, non-lactating female patients at least 18 years of age

Annotated entities:
- Pregnancy_considerations: "Male or non-pregnant, non-lactating female patients at least 18 years of age"